Endocrine disorders such as primary aldosteronism, pheochromocytoma, hyper- or hypothyroidism, insulin-dependent diabetes mellitus

The above is a clinical trial exclusion criterion. Annotated with entity spans:
[Condition: Endocrine disorders] such as [Condition: primary aldosteronism], [Condition: pheochromocytoma], [Condition: hyper]- or [Condition: hypothyroidism], [Qualifier: insulin-dependent] [Condition: diabetes mellitus]